chronic kidney disease stage IV and V

The above is a clinical trial exclusion criterion. Annotated with entity spans:
[Condition: chronic kidney disease] [Qualifier: stage IV] and V